Clinical trial exclusion criterion:
A family history of congenital or hereditary immunodeficiency.

Entity relations:
- AND("family history", "congenital immunodeficiency")
- AND("family history", "hereditary immunodeficiency")